Clinical trial exclusion criterion:
Concomitant treatment with high doses of acetylsalicylic acid (> 500 mg/day) or continuous treatment with non-steroidal anti-inflammatory drugs

Annotated entities:
- Temporal: "Concomitant"
- Procedure: "treatment"
- Multiplier: "high doses"
- Drug: "acetylsalicylic acid"
- Multiplier: "> 500 mg/day"
- Temporal: "continuous"
- Procedure: "treatment"
- Drug: "non-steroidal anti-inflammatory drugs"